Clinical trial exclusion criterion:
An interval of < 6 months from the completion of cytotoxic chemotherapy in the neo-adjuvant or adjuvant setting until the time of metastatic diagnosis.

Annotated entities:
- Value: "< 6 months"
- Procedure: "cytotoxic chemotherapy"
- Qualifier: "neo-adjuvant setting"
- Qualifier: "adjuvant setting"
- Condition: "metastatic diagnosis"